Clinical trial inclusion criterion:
International normalized ratio (INR) > 1.5 ×ULN

Entity relations:
- Has_value("International normalized ratio (INR)", "> 1.5 ×ULN")